某 24 歲女性，在計程車上突然感到心跳得厲害、喘不過氣來、發抖、想吐，她怕自己馬上會死掉，請司機送她到最近的急診處。約二十分鐘到達急診處時，她那些症狀都消失了，但仍心有餘悸。關於這個女性，下列敘述那項是錯的？
A. 至少在急診處要進行完整的身體檢查和心電圖檢查。血糖、甲狀腺功能、肝功能、腎功能檢查也是必要的
B. 若無相關身體疾病，她的診斷可能是恐慌發作
C. 若無相關身體疾病，她最恰當的藥物治療是非典型抗精神病劑
D. 若無相關身體疾病，她最可能有效的心理治療是認知行為治療

正確答案：C. 若無相關身體疾病，她最恰當的藥物治療是非典型抗精神病劑